有關類結核型痲瘋病（tuberculoid leprosy）及癩瘤型痲瘋病（lepromatous leprosy）的敘述，下列何者正確？
A. 類結核型痲瘋病病灶組織中可以觀察到泡沫巨噬細胞（foamy macrophages），是癩瘤型痲瘋病所沒有的特徵
B. 類結核型痲瘋病患的細胞性免疫反應（cellular immune reaction）較癩瘤型痲瘋病患為強
C. 類結核型痲瘋病的傳染力較癩瘤型痲瘋病為高
D. 癩瘤型痲瘋病患之皮膚對麻瘋菌素（lepromin）測試呈陽性反應

正確答案：B. 類結核型痲瘋病患的細胞性免疫反應（cellular immune reaction）較癩瘤型痲瘋病患為強